Clinical trial inclusion criterion:
Minimum of 24 permanent teeth.

Annotated entities:
- Multiplier: "Minimum of 24"
- Observation: "permanent teeth"